Clinical trial inclusion criterion:
Primary or secondary infertility: tubal occlusion, male factor, unexplained, endometriosis, ovarian factors…

Entity relations:
- Subsumes("Primary infertility", "tubal occlusion")
- OR("Primary infertility", "secondary infertility")
- OR("tubal occlusion", "male factor", "unexplained factors", "endometriosis", "ovarian factors")